Clinical trial exclusion criterion:
6. In the past 2 months involved in other drugs or devices clinical trials

Annotated entities:
- Competing_trial: "In the past 2 months involved in other drugs or devices clinical trials"